Clinical trial exclusion criterion:
Legally mandated to participate in treatment

Annotated entities:
- Non-query-able: "Legally mandated to participate in treatment"